Congenital or rheumatic heart diseases

The above is a clinical trial exclusion criterion. Annotated with entity spans:
[Qualifier: Congenital] or [Qualifier: rheumatic] [Condition: heart diseases]